How does Hst5 (histatin 5) affect infections by Candida glabrata?

Our results, taken together, demonstrated that histatin-5 possessed the fungicidal activity against Candida species other than C. glabrata.